Aged 18-80

The above is a clinical trial inclusion criterion. Annotated with entity spans:
[Person: Aged] [Value: 18-80]